Clinical trial exclusion criterion:
have sleep apnea, or are shift workers

Entity relations:
- OR("sleep apnea", "shift workers")